Clinical trial exclusion criterion:
9. Severe arthritis or other problems that limit passive range of motion;

Annotated entities:
- Parsing_Error: "9."
- Condition: "Severe arthritis"
- Condition: "problems that limit passive range of motion"
- Undefined_semantics: "problems that limit passive range of motion"